Signed written informed consent.

The above is a clinical trial inclusion criterion. Annotated with entity spans:
[Post-eligibility: Signed written informed consent].